The common house cat, Felis silvestris catus and the domestic dog, Canis familiaris both belong to what taxonomic order?

domestic dogs and cats can be interpreted in terms of their descent from members of the order Carnivora.